Clinical trial inclusion criteria:
Patients scheduled for dental extraction and treated with edoxaban, apixaban, rivaroxaban or dabigatran
Not having taken the direct oral anticoagulant on the day of the extraction
Provision of signed and dated informed consent form
Stated willingness to comply with all study procedures and availability for the duration of the study

Annotated entities:
- Mood: "scheduled for"
- Procedure: "dental extraction"
- Drug: "edoxaban"
- Drug: "apixaban"
- Drug: "rivaroxaban"
- Drug: "dabigatran"
- Temporal: "on the day of the extraction"
- Reference_point: "extraction"
- Negation: "Not"
- Drug: "anticoagulant"
- Qualifier: "oral"
- Post-eligibility: "Provision of signed and dated informed consent form"
- Post-eligibility: "Stated willingness to comply with all study procedures and availability for the duration of the study"